Clinical trial inclusion criterion:
Medically and neurologically healthy on the basis of physical examination and medical history.

Annotated entities:
- Condition: "neurologically healthy"
- Condition: "Medically healthy"
- Procedure: "physical examination"
- Temporal: "medical history"